Clinical trial exclusion criterion:
History of gastrointestinal malabsorption or gastric bypass surgery

Annotated entities:
- Condition: "gastrointestinal malabsorption"
- Procedure: "gastric bypass surgery"